Renal insufficiency defined as creatinine clearance < 60 mL/min

The above is a clinical trial exclusion criterion. Annotated with entity spans:
[Condition: Renal insufficiency] defined as [Measurement: creatinine clearance] [Value: < 60 mL/min]